Clinical trial inclusion criterion:
age between 18-80 years old

Entity relations:
- Has_value("age", "between 18-80 years")